Clinical trial exclusion criterion:
Hyperthyroidism, advanced arteriosclerosis, symptomatic cardiovascular disease, serious structural cardiac abnormalities, cardiomyopathy, serious heart rhythm abnormalities, or a family history of sudden death or death related to heart problems

Entity relations:
- Has_qualifier("arteriosclerosis", "advanced")
- Has_qualifier("cardiovascular disease", "symptomatic")
- Has_qualifier("structural cardiac abnormalities", "serious")
- Has_qualifier("heart rhythm abnormalities", "serious")
- Has_qualifier("death related to heart problems", "related to heart problems")
- Has_context("sudden death", "family history")
- OR("sudden death", "death related to heart problems")
- OR("Hyperthyroidism", "sudden death", "cardiomyopathy", "structural cardiac abnormalities", "cardiovascular disease", "arteriosclerosis", "heart rhythm abnormalities")